Clinical trial exclusion criterion:
Born prior to 34 weeks

Entity relations:
- Has_value("Born", "prior to 34 weeks")